一個食道閉鎖（esophageal atresia）的新生兒，腹部X光顯示沒有腸氣的存在，下列何者發生率較高？
A. 食道閉鎖併遠端氣管食道瘻管
B. 食道閉鎖併近端氣管食道瘻管
C. 食道閉鎖無合併氣管食道瘻管
D. 食道閉鎖併近端遠端氣管食道瘻管

正確答案：C. 食道閉鎖無合併氣管食道瘻管